Clinical trial inclusion criterion:
International normalized ratio (INR) > 1.5 ×ULN

Annotated entities:
- Measurement: "International normalized ratio (INR)"
- Value: "> 1.5 ×ULN"